Patient refusal for supraclavicular block

The above is a clinical trial exclusion criterion. Annotated with entity spans:
[Observation: Patient refusal] for [Procedure: supraclavicular block]